一位 23 歲，懷孕 29 週的孕婦因提早破水來住院，3 天後孕婦發燒，白血球數目增加，胎兒心跳稍快，且孕婦下腹有明顯壓痛，則最可能診斷為何？
A. 急性腎盂腎炎（acute pyelonephritis）
B. 絨毛羊膜炎（chorioamnionitis）
C. 巨細胞病毒感染（cytomegalovirus infection）
D. 急性闌尾炎（acute appendicitis）

正確答案：B. 絨毛羊膜炎（chorioamnionitis）